Clinical trial exclusion criterion:
Severe Renal dysfunction (Ccr<30 ml/min)

Entity relations:
- Has_qualifier("Renal dysfunction", "Severe")
- Subsumes("Renal dysfunction", "Ccr")
- Has_value("Ccr", "<30 ml/min")